Participants must be willing to comply with all study related procedures

The above is a clinical trial inclusion criterion. Annotated with entity spans:
[Post-eligibility: Participants must be willing to comply with all study related procedures]